下列有關規律從事運動可減少發生冠狀動脈心臟疾病的可能機制，何者為誤？
A. 增加對胰島素作用之阻抗（Insulin resistance）
B. 增加血液中高密度脂蛋白膽固醇（HDL-Cholesterol）濃度
C. 降低身體脂肪比率（Body fat ratio）
D. 降低血液中三酸甘油酯（Triglyceride）濃度

正確答案：A. 增加對胰島素作用之阻抗（Insulin resistance）